正常情況下，人類每天經由大便排出之水分約有多少？
A. 50 毫升以下
B. 100-150 毫升
C. 200-250 毫升
D. 300-350 毫升

正確答案：B. 100-150 毫升